Clinical trial inclusion criterion:
= 20years of age;

Annotated entities:
- Person: "age"
- Value: "= 20years"